Clinical trial inclusion criterion:
Men must be completely contraception and prohibited donation and sperm donation during the treatment process and in 28 days after treatment;

Entity relations:
- Has_index("during the treatment process", "treatment")
- Has_index("in 28 days after treatment", "treatment")
- Has_negation("sperm donation", "prohibited")
- Has_temporal("contraception", "during the treatment process")
- Has_temporal("sperm donation", "during the treatment process")
- Has_negation("donation", "prohibited")
- Has_temporal("donation", "during the treatment process")
- Has_temporal("contraception", "in 28 days after treatment")
- Has_temporal("sperm donation", "in 28 days after treatment")
- Has_temporal("donation", "in 28 days after treatment")